下列何者並非疾病診斷關聯群（DRGs）分類病人之變項？
A. 年齡、性別
B. 手術類別
C. 生理特質
D. 疾病診斷

正確答案：C. 生理特質